Clinical trial exclusion criterion:
Spondylolisthesis Grade II or higher.

Annotated entities:
- Condition: "Spondylolisthesis"
- Measurement: "Grade"
- Value: "II or higher"